Clinical trial exclusion criterion:
Known risk factors for, or presence of, a cardiovascular disease

Annotated entities:
- Condition: "cardiovascular disease"
- Observation: "risk factors cardiovascular disease"